Clinical trial exclusion criterion:
Patients:

Annotated entities:
- Parsing_Error: "Patients:"